Clinical trial exclusion criterion:
Severe hepatocellular insufficiency (ASAT or ALAT > 5N, or bilirubin > 2N)

Annotated entities:
- Condition: "hepatocellular insufficiency"
- Measurement: "ASAT"
- Measurement: "ALAT"
- Value: "> 5N"
- Measurement: "bilirubin"
- Value: "> 2N"